Stoma

The above is a clinical trial exclusion criterion. Annotated with entity spans:
[Condition: Stoma]